Clinical trial exclusion criterion:
have experienced 1 or more falls in the last month before the study

Entity relations:
- Has_multiplier("falls", "1 or more")
- Has_index("in the last month before the study", "last month before the study")
- Has_temporal("falls", "in the last month before the study")